At least 70 yrs old

The above is a clinical trial inclusion criterion. Annotated with entity spans:
[Value: At least 70 yrs] [Person: old]